Clinical trial inclusion criterion:
De novo lesion CTO

Annotated entities:
- Condition: "CTO"
- Qualifier: "De novo lesion"